下列何種阿米巴原蟲對人體不具致病性？
A. 痢疾阿米巴（Entamoeba histolytica）
B. 棘阿米巴（Acanthamoeba spp.）
C. 迪斯帕阿米巴（Entamoeba dispar）
D. 福氏耐格利阿米巴（Naegleria fowleri）

正確答案：C. 迪斯帕阿米巴（Entamoeba dispar）